Ability to give informed consent

The above is a clinical trial inclusion criterion. Annotated with entity spans:
[Observation: Ability to give informed consent]